Previous vaccination against meningococcal disease with either the study vaccine or another meningococcal vaccine

The above is a clinical trial exclusion criterion. Annotated with entity spans:
Previous [Procedure: vaccination against meningococcal disease] with either the [Drug: study vaccine] or [Drug: another meningococcal vaccine]